Clinical trial exclusion criterion:
Known intolerance or contraindication to ticagrelor or ASA

Annotated entities:
- Condition: "contraindication"
- Condition: "intolerance"
- Drug: "ticagrelor"
- Drug: "ASA"